Subject not fluent in English or an appropriate translator not available

The above is a clinical trial exclusion criterion. Annotated with entity spans:
[Post-eligibility: Subject not fluent in English or an appropriate translator not available]